Clinical trial exclusion criterion:
Active hepatic disease

Annotated entities:
- Condition: "hepatic disease"
- Qualifier: "Active"